3. Family history of hypertriglyceridemia or fasting triglyceride>4.56 mmol/L;

The above is a clinical trial exclusion criterion. Annotated with entity spans:
3. [Observation: Family history] of [Condition: hypertriglyceridemia] or [Measurement: fasting triglyceride][Value: >4.56 mmol/L];